Clinical trial exclusion criterion:
Patients with a known allergy to ketamine or etomidate.

Entity relations:
- AND("allergy", "ketamine")
- OR("ketamine", "etomidate")